Clinical trial inclusion criterion:
Patient is at least 18 at the day of screening.

Annotated entities:
- Temporal: "at least 18 at the day of screening"
- Reference_point: "screening"